Clinical trial inclusion criterion:
HIV- uninfected women desiring PrEP

Annotated entities:
- Condition: "HIV- uninfected"
- Person: "women"
- Procedure: "PrEP"
- Mood: "desiring"